有關配戴隱形眼鏡不當，引起之缺氧性角膜炎（hypoxic keratitis）之敘述，下列何者錯誤？
A. 最常見者為表淺性點狀角膜炎（superficial punctate keratitis）
B. 慢性缺氧會造成脂質（lipid）沈積
C. 通常不會伴隨角膜破皮
D. 通常伴隨虹彩炎

正確答案：D. 通常伴隨虹彩炎